Which is the most common monogenic cause of common variable immunodeficiency (CVID) in Europeans?

Loss-of-function nuclear factor kB subunit 1 (NFKB1) variants are the most common monogenic cause of common variable immunodeficiency (CVID) in Europeans.